Clinical trial exclusion criterion:
Severe critical limb ischemia (Rutherford category 6)

Annotated entities:
- Qualifier: "Severe"
- Qualifier: "critical"
- Condition: "limb ischemia"
- Measurement: "Rutherford category"
- Value: "6"